Clinical trial inclusion criterion:
Taking an NNRTI or integrase containing regimen without prior history of use of PI for more than 2 weeks

Annotated entities:
- Drug: "NNRTI"
- Drug: "integrase"
- Negation: "without"
- Temporal: "prior"
- Drug: "PI"
- Value: "for more than 2 weeks"
- Procedure: "regimen"